Clinical trial exclusion criterion:
Patients actively listed for transplantation at time of entry into the study or anticipated to undergo heart transplantation, interventional catheterization, or corrective cardiac surgery during the 7 months following entry into the study

Annotated entities:
- Mood: "listed for transplantation"
- Procedure: "transplantation"
- Temporal: "at time of entry into the study"
- Reference_point: "entry into the study"
- Mood: "anticipated to undergo"
- Procedure: "heart transplantation"
- Procedure: "interventional catheterization"
- Procedure: "corrective cardiac surgery"
- Temporal: "during the 7 months following entry into the study"
- Reference_point: "entry into the study"